下列那一種真菌屬於淺部皮膚感染真菌？
A. 白色念珠菌（Candida albicans）
B. 新形隱球菌（Cryptococcus neoformans）
C. 白癬菌（Trichophyton tonsurans）
D. 申克氏孢絲菌（Sporothrix schenckii）

正確答案：C. 白癬菌（Trichophyton tonsurans）